Clinical trial inclusion criterion:
Ongoing treatment with analgesics

Annotated entities:
- Temporal: "Ongoing"
- Procedure: "treatment"
- Drug: "analgesics"